Clinical trial exclusion criterion:
Brain metastases that are untreated, symptomatic, or require therapy to control symptoms or any radiation, surgery, or other therapy to control symptoms from brain metastases within 2 months prior to randomization.

Annotated entities:
- Condition: "Brain metastases"
- Qualifier: "untreated"
- Qualifier: "symptomatic"
- Qualifier: "require therapy"
- Procedure: "radiation"
- Procedure: "surgery"
- Procedure: "other therapy to control symptoms"
- Condition: "brain metastases"
- Temporal: "within 2 months prior to randomization"
- Reference_point: "randomization"